Clinical trial exclusion criterion:
Known prolonged QTc (or evidence of such at screening) on electrocardiogram defined as >470 ms

Entity relations:
- Has_value("QTc", ">470 ms")
- AND("electrocardiogram", "QTc")